Clinical trial exclusion criterion:
Patients with a supratheraputic (>3.0) INR

Annotated entities:
- Value: "supratheraputic"
- Value: ">3.0"
- Measurement: "INR"